Durante situaciones estresantes que suponen una reacción por parte de la persona, puede suceder que:
1. La regresión es una reacción ante las situaciones que se dan en la edad adulta únicamente.
2. La regresión es una reacción normal del envejecimiento, pero no ante situaciones estresantes.
3. La regresión es un mecanismo de defensa ante este tipo de situaciones.
4. La regresión cuando se da en el niño, en situaciones estresantes, indicaría problemas del crecimiento y desarrollo.

Respuesta correcta: 3. La regresión es un mecanismo de defensa ante este tipo de situaciones.